一 50 歲男性因出血和發燒來求診，理學檢查發現：貧血、脾臟腫大及下肢有出血點。實驗室檢查結果為：Hb：7.0 gm/dL，WBC：1500/cumm、60%為淋巴球、血小板為 75000/cumm、細胞生化染色 Tartrate-resistant acid phosphatase 為陽性。請問：診斷為何？
A. 慢性淋巴球性白血病（CLL）
B. 髮樣細胞性白血病（hairy cell leukemia）
C. 成年性 T-細胞白血病（adult T-cell leukemia）
D. 急性淋巴球性白血病（ALL）

正確答案：B. 髮樣細胞性白血病（hairy cell leukemia）